Non-diabetic ulcers Orthopedic or neuromuscular pathologic conditions

The above is a clinical trial exclusion criterion. Annotated with entity spans:
[Line: Non-diabetic ulcers] [Line: Orthopedic or neuromuscular pathologic conditions]